Clinical trial exclusion criterion:
Previous treatment with anti-VEGF drugs or corticosteroid or grid laser photocoagulation (study eye)

Entity relations:
- OR("anti-VEGF drugs", "corticosteroid", "grid laser photocoagulation (")